一個 68 歲的男性病人，突然間左側手腳無力，講話不清楚，但意識清醒，被送到急診室，發現血壓為 160/95 mmHg，腦部電腦斷層並無出血之現象。下列處置何者最不適當？
A. 給予 aspirin
B. 讓病人臥床休息
C. 給予降血壓藥物
D. 心電圖檢查

正確答案：C. 給予降血壓藥物